What are Drosophila's balancer chromosomes?

Balancer chromosomes are genetic reagents that are used in Drosophila melanogaster for stock maintenance and mutagenesis screens. This problem is of particular importance when the mutant allele has been maintained with a balancer chromosome. From four isogenic lines of Drosophila melanogaster, four sets of recombinant extracted lines were constructed using standard balancer-chromosome techniques